Which R/bioconductor package has been developed to aid in epigenomic analysis?

DeepBlueR is a package that allows for large-scale epigenomic analysis in R.